Clinical trial exclusion criterion:
History of epilepsy

Annotated entities:
- Condition: "epilepsy"